Clinical trial inclusion criterion:
All patients must be informed of the investigational nature of this study and give written informed consent in accordance with institutional and federal guidelines.

Annotated entities:
- Post-eligibility: "All patients must be informed of the investigational nature of this study and give written informed consent in accordance with institutional and federal guidelines."